En un estudio de cohortes el número de casos nuevos de enfermedad por persona y por unidad de tiempo es:
1. La incidencia anual.
2. La incidencia o probabilidad acumulada.
3. La tasa de prevalencia.
4. La densidad o tasa de incidencia.
5. El riesgo relativo de desarrollar la enfermedad.

Respuesta correcta: 4. La densidad o tasa de incidencia.